Entre los leucocitos circulantes en sangre, los menos abundantes son:
1. Los basófilos.
2. Los linfocitos.
3. Los monocitos.
4. Los eosinófilos.

Respuesta correcta: 1. Los basófilos.